Another household member enrolled in the study

The above is a clinical trial exclusion criterion. Annotated with entity spans:
[Non-query-able: Another household member enrolled in the study]